= 5 episodes of VT treated with antitachycardia pacing (ATP) regardless of symptoms

The above is a clinical trial inclusion criterion. Annotated with entity spans:
= [Multiplier: 5 episodes] of [Condition: VT] treated with [Procedure: antitachycardia pacing] ([Procedure: ATP]) regardless of symptoms